El aceite de inmersión que se usa para la observación microscópica:
1. Protege a la muestra del efecto oxidante del aire.
2. Lubrica la lente del objetivo.
3. Reduce la refracción y aumenta la resolución.
4. Actúa como una lente que aumenta la magnificación.
5. Evita la deshidratación de la preparación.

Respuesta correcta: 3. Reduce la refracción y aumenta la resolución.